Patients with active autoimmune disease or a documented history of autoimmune disease or syndrome that requires systemic steroids or immunosuppressive agents. Patients with vitiligo or resolved childhood asthma/atopy would be exception to this rule. Patients that require inhaled steroids or local steroid injections would not be excluded from the study. Patients with hypothyroidism not from autoimmune disease that is stable on hormone replacement will not be excluded from the study.

The above is a clinical trial exclusion criterion. Annotated with entity spans:
Patients with [Temporal: active] [Condition: autoimmune disease] or a documented [Temporal: history] of [Condition: autoimmune disease] or [Condition: syndrome that requires systemic steroids] or [Drug: immunosuppressive agents]. [Not_a_criteria: Patients with vitiligo or resolved childhood asthma/atopy would be exception to this rule.] [Not_a_criteria: Patients that require inhaled steroids or local steroid injections would not be excluded from the study.] [Not_a_criteria: Patients with hypothyroidism not from autoimmune disease that is stable on hormone replacement will not be excluded from the study.]